Clinical trial exclusion criterion:
Clinically significant cardiovascular disease (including myocardial infarction, unstable angina, symptomatic congestive heart failure, serious uncontrolled cardiac arrhythmia) <=6 months prior to enrolment.

Annotated entities:
- Qualifier: "Clinically significant"
- Condition: "cardiovascular disease"
- Condition: "myocardial infarction"
- Condition: "unstable angina"
- Condition: "congestive heart failure"
- Qualifier: "symptomatic"
- Qualifier: "serious"
- Qualifier: "uncontrolled"
- Condition: "cardiac arrhythmia"
- Temporal: "<=6 months prior to enrolment"
- Reference_point: "enrolment"